Inability to walk;

The above is a clinical trial exclusion criterion. Annotated with entity spans:
[Condition: Inability to walk];